Clinical trial inclusion criterion:
Known hypersensitivity to clopidogrel or ticagrelor or any of its components

Annotated entities:
- Condition: "hypersensitivity"
- Drug: "clopidogrel"
- Drug: "ticagrelor"
- Drug: "any of its components"